Clinical trial exclusion criterion:
A medical condition that could interfere with study participation

Annotated entities:
- Non-query-able: "A medical condition that could interfere with study participation"